Clinical trial inclusion criterion:
Estimated glomerular filtration rate (eGFR) > 30 ml/min

Annotated entities:
- Measurement: "Estimated glomerular filtration rate (eGFR)"
- Value: "> 30 ml/min"